Clinical trial inclusion criterion:
Written informed consent

Annotated entities:
- Informed_consent: "Written informed consent"